Malignant hypertension

The above is a clinical trial exclusion criterion. Annotated with entity spans:
[Condition: Malignant hypertension]